Gadolinium intolerance

The above is a clinical trial exclusion criterion. Annotated with entity spans:
[Drug: Gadolinium] [Condition: intolerance]